What disease is associated with mutations in the MECP2 transcription factor?

Mutations in the methyl-CpG-binding protein-2 gene (MECP2) are commonly associated with Rett syndrome. Mutations in the MECP2 gene cause the neurodevelopmental disorder Rett syndrome (RTT).